大部分的真核細胞含40～50種不同的tRNAs，下列何者是這些tRNA之共同序列？
A. 3'端含-CCA-3'OH
B. 3'端含-AAC-3'OH
C. 5'端含-CCAp-5'
D. 5'端含-AACp-5'

正確答案：A. 3'端含-CCA-3'OH